2. Abnormal blood biochemistry defined as 3 times that of the upper limit of the normal range.

The above is a clinical trial exclusion criterion. Annotated with entity spans:
[Parsing_Error: 2.] [Value: Abnormal] [Measurement: blood biochemistry] defined as [Value: 3 times that of the upper limit of the normal range].